Which protein is associated with hyperemesis gravidarum during pregrancy?

Human chorionic gonadotropin (hCG) is associated with hyperemesis gravidarum during pregrancy.